Which is the master oncogenic transcription factor in T-cell acute lymphoblastic leukemia?

The oncogenic transcription factor TAL1/SCL induces an aberrant transcriptional program in T-cell acute lymphoblastic leukemia (T-ALL) cells.